Presence or history of dysphagia or conditions predisposing to dysphagia (eg, uncontrolled gastroesophageal reflux disease [GERD], dyspepsia, etc)

The above is a clinical trial exclusion criterion. Annotated with entity spans:
Presence or [Temporal: history of] [Condition: dysphagia] or [Condition: conditions predisposing to dysphagia] (eg, [Qualifier: uncontrolled] [Condition: gastroesophageal reflux disease] [[Condition: GERD]], [Condition: dyspepsia], etc)